Clinical trial exclusion criterion:
chronic liver disease (including known active hepatitis) and/or screening alanine transaminase (ALT) or aspartate transaminase (AST) > 3 x upper limit of normal (ULN) (confirmed on a second day)

Annotated entities:
- Condition: "chronic liver disease"
- Condition: "active hepatitis"
- Measurement: "alanine transaminase"
- Measurement: "ALT"
- Measurement: "aspartate transaminase"
- Measurement: "AST"
- Value: "> 3 x upper limit of normal"